復發－緩解型之多發性硬化症（relapsing-remitting type of multiple sclerosis）病人在疾病緩解期 （remitting stage）須接受治療以減少疾病復發，下列那一項選擇為最不適當之藥物？
A. interferon-β1b
B. interferon-β1a
C. nonsteroid anti-inflammatory drugs
D. glatiramer acetate

正確答案：C. nonsteroid anti-inflammatory drugs